Clinical trial exclusion criterion:
antibiotic use in the last 7 days

Entity relations:
- Has_temporal("antibiotic", "last 7 days")